potassium > 6 mg/dl

The above is a clinical trial exclusion criterion. Annotated with entity spans:
[Measurement: potassium] [Value: > 6 mg/dl]